Clinical trial exclusion criterion:
With bad compliance or contraindication to enrollment.

Annotated entities:
- Condition: "bad compliance"
- Subjective_judgement: "bad compliance"
- Condition: "contraindication to enrollment"
- Subjective_judgement: "contraindication to enrollment"
- Undefined_semantics: "contraindication to enrollment"